En un paciente con síntomas de asma, la confirmación diagnóstica de la enfermedad se efectuará en primer lugar mediante:
1. La constatación de una obstrucción reversible del flujo aéreo en la espirometría.
2. Unas pruebas cutáneas alérgicas positivas.
3. Un incremento del número de eosinófilos en el esputo inducido.
4. La elevación del óxido nítrico en el aire espirado (FENO).
5. La presencia de una Ig E específica en sangre a un aeroalérgeno.

Respuesta correcta: 1. La constatación de una obstrucción reversible del flujo aéreo en la espirometría.